What is the association of circular RNA to breast cancer?

circRNAs are differentially expressed in breast cancer and are important in carcinogenesis because they participate in cancer-related pathways and sequester miRNAs. circRNA frequency may be a marker for cell proliferation in breast cancer.